Como inclusión propia de las células plasmáticas se considera la presencia de:
1. Anomalía de Pelger-Huët.
2. Anomalía de Alder-Reilly.
3. Bastones de Auer.
4. Cuerpos de Howell.
5. Cuerpos de Russel.

Respuesta correcta: 5. Cuerpos de Russel.